En relación con las propiedades coligativas de una disolución se puede decir que:
1. Tienen su origen en la disminución del potencial químico del disolvente por el hecho de añadirle un soluto.
2. El descenso en la presión de vapor del disolvente al que se le añade un soluto no volátil es directamente proporcional a la fracción molar del disolvente.
3. La adición de un soluto a un disolvente hace que el intervalo de temperaturas en las que la disolución se mantiene en estado líquido sea menor que el correspondiente al disolvente puro.
4. La constante molal de descenso del punto de congelación depende de la naturaleza del soluto disuelto.
5. El descenso crioscópico es una técnica aplicable a la determinación de la masa molar del disolvente.

Respuesta correcta: 1. Tienen su origen en la disminución del potencial químico del disolvente por el hecho de añadirle un soluto.